Clinical trial inclusion criterion:
Both genders eligible for study.

Annotated entities:
- Person: "Both genders"